Clinical trial exclusion criterion:
chronic diseases e.g. cerebral palsy, metabolic disease, etc.

Annotated entities:
- Condition: "chronic diseases"
- Condition: "cerebral palsy"
- Condition: "metabolic disease"